Clinical trial inclusion criterion:
Adequate heart function

Entity relations:
- Has_value("heart function", "Adequate")
- multi("Adequate heart function", "heart function")